Clinical trial exclusion criterion:
history of uterine surgery

Entity relations:
- Has_temporal("uterine surgery", "history")